¿Cuál es la molécula fotorreceptora presente en los bastones?:
1. 11-cis-retinal.
2. Opsina.
3. Rodopsina.
4. 11-trans-retinal.

Respuesta correcta: 3. Rodopsina.